Clinical trial inclusion criterion:
Age from birth to 21 years

Entity relations:
- Has_value("Age", "from birth to 21 years")